Clinical trial exclusion criterion:
Metastatic disease (M1)/stage 4 NSCLC

Annotated entities:
- Condition: "Metastatic disease NSCLC"
- Condition: "(M1)/stage 4"